Clinical trial exclusion criterion:
Current TB or TB treatment in = 6 months (contain active antibiotics against Orientia spp.)

Annotated entities:
- Condition: "TB"
- Procedure: "TB treatment"
- Temporal: "in = 6 months"